Clinical trial exclusion criterion:
colostomy, or do not perform regular bowel care for any reason

Annotated entities:
- Procedure: "colostomy"
- Procedure: "regular bowel care"
- Negation: "do not perform"